Clinical trial exclusion criterion:
Are currently enrolled in another smoking cessation trial

Annotated entities:
- Competing_trial: "Are currently enrolled in another smoking cessation trial"